Clinical trial exclusion criterion:
any presence of serious medical conditions ( esp. cardiac, renal, liver diseases)

Annotated entities:
- Condition: "serious medical conditions"
- Condition: "cardiac diseases"
- Condition: "liver diseases"
- Condition: "renal diseases"